Son operculados los huevos de:
1. Hymenolepis nana.
2. Trichinella spiralis.
3. Enterobius vermicularis.
4. Fasciola heptica.
5. Ascaris lumbricoides.

Respuesta correcta: 4. Fasciola heptica.